Modified Lanza Score grade 0-1 measured by upper gastrointestinal endoscopy

The above is a clinical trial inclusion criterion. Annotated with entity spans:
[Measurement: Modified Lanza Score grade] [Value: 0-1] measured by [Procedure: upper gastrointestinal endoscopy]